有關子宮頸上皮內腫瘤（CIN）的治療，下列何者正確？
A. CIN I 要馬上治療
B. CIN II 不宜作冷凍治療
C. CIN III 可作子宮頸錐狀切除
D. CIN III 必須作全子宮切除

正確答案：C. CIN III 可作子宮頸錐狀切除